急診面對一位發燒病人，血壓75/40 mmHg，心跳105/min，心功能指標（cardiac index）下降，但中央靜脈壓力（central venous pressure）上升，最有可能診斷為何？
A. 心因性休克
B. 敗血性休克
C. 低血容積休克
D. 神經性休克

正確答案：A. 心因性休克